Clinical trial exclusion criterion:
Renal dialysis

Annotated entities:
- Procedure: "Renal dialysis"